Clinical trial exclusion criterion:
Receipt of chemotherapy for prostate or other cancer within the past 12 months with residual cognitive deficits, or receipt of chemotherapy for mCRPC. Patients/physicians planning treatment with chemotherapy during the 12 month period of the investigation are also ineligible.

Entity relations:
- Has_qualifier("cancer", "other")
- AND("chemotherapy", "prostate cancer")
- Has_temporal("chemotherapy", "within the past 12 months")
- AND("chemotherapy", "residual cognitive deficits")
- AND("chemotherapy", "mCRPC")
- OR("prostate cancer", "cancer")
- OR("chemotherapy", "chemotherapy")